關於低血磷佝僂症（hypophosphatemic rickets）之敘述，下列何者較罕見？
A. 血鈣正常
B. 血清鹼性磷酸酶（alkaline phosphatase）值高於正常
C. 血清副甲狀腺素（parathyroid hormone）濃度高於正常
D. 血清1,25-二羥維生素D（1,25-dihydroxyvitamin D）值正常

正確答案：C. 血清副甲狀腺素（parathyroid hormone）濃度高於正常